Allergy to Pregnyl® or some of its ingredients in the medication or other contraindications due to Pregnyl®

The above is a clinical trial exclusion criterion. Annotated with entity spans:
[Condition: Allergy] to [Drug: Pregnyl]® or [Drug: some of its ingredients] in the medication or other [Condition: contraindications] due to [Drug: Pregnyl]®